下列何者不附	於坐骨棘（ischial spine）上？
A. 尾骨肌（coccygeus）
B. 梨狀肌（piriformis）
C. 上孖肌（superior gemellus）
D. 薦棘韌帶（sacrospinous ligament）

正確答案：B. 梨狀肌（piriformis）